Administration of licensed vaccines within 2 weeks (for inactivated vaccines) or 4 weeks (for live vaccines) prior to enrolment in this study.

The above is a clinical trial exclusion criterion. Annotated with entity spans:
Administration of [Drug: licensed vaccines] [Temporal: within 2 weeks] (for [Drug: inactivated vaccines]) or 4 weeks (for [Drug: live vaccines]) prior to enrolment in this study.